Clinical trial inclusion criterion:
Patient received apatinib treatment regimen at investigators' discretion;

Annotated entities:
- Drug: "apatinib"